Clinical trial exclusion criterion:
Age less than one year or over 18 years

Entity relations:
- Has_value("Age", "less than one year")
- OR("less than one year", "over 18 years")